Breech presentation

The above is a clinical trial inclusion criterion. Annotated with entity spans:
[Observation: Breech presentation]